Clinical trial exclusion criterion:
Patients who tool medicine such as PPI, APA,H2blocker, Muscarine receptor antagonist, anti-gastic agent, antacid, anticaogulant, Bisphosphonate agents, Cytotoxic drug, NSAID, adrenal cortex hormone agents (topical treatment is allowed)

Annotated entities:
- Drug: "PPI"
- Drug: "APA"
- Drug: "H2blocker"
- Drug: "Muscarine receptor antagonist"
- Drug: "anti-gastic agent"
- Drug: "antacid"
- Drug: "anticaogulant"
- Drug: "Bisphosphonate agents"
- Drug: "Cytotoxic drug"
- Drug: "NSAID"
- Drug: "adrenal cortex hormone agents"
- Procedure: "topical treatment"
- Negation: "allowed"